Clinical trial exclusion criterion:
Allergy/intolerance to any of the components of medications used in the treatment.

Entity relations:
- AND("Allergy", "components of medications used in the treatment")
- OR("Allergy", "intolerance")